Clinical trial exclusion criterion:
5. Cardiopulmonary diseases

Annotated entities:
- Parsing_Error: "5."
- Condition: "Cardiopulmonary diseases"